Clinical trial exclusion criterion:
Subjects with a history of thrombosis or other reason (other than sickle cell disease) for enhanced thrombotic risk

Entity relations:
- Has_mood("thrombotic risk", "enhanced risk")
- Has_temporal("thrombosis", "history")
- Has_negation("sickle cell disease", "other than")
- multi("thrombotic risk", "thrombotic")
- AND("thrombosis", "sickle cell disease")
- OR("thrombosis", "thrombotic risk")